subjects in good health upon medical history, physical exam, and laboratory testing in the opinion of the investigator

The above is a clinical trial inclusion criterion. Annotated with entity spans:
subjects in [Condition: good health] upon [Temporal: medical history], [Procedure: physical exam], and [Procedure: laboratory testing] in the opinion of the investigator